Which disorders are caused by de novo mutations in ZSWIM6?

A recurrent de novo nonsense variant in ZSWIM6 results in severe intellectual disability without frontonasal or limb malformations. Also, a recurrent de novo missense variant within the C-terminal Sin3-like domain of ZSWIM6 has previously been reported to cause acromelic frontonasal dysostosis (AFND), an autosomal-dominant severe frontonasal and limb malformation syndrome, associated with neurocognitive and motor delay, via a proposed gain-of-function effect.